黏膜下顎裂（submucous cleft palate）病患有多少百分比產生 velopharyngeal insufficiency，需要手術 治療？
A. 15
B. 35
C. 55
D. 75

正確答案：A. 15